Known immediate or delayed hypersensitivity reaction or idiosyncrasy to drugs chemically related to panitumumab or excipients that contraindicates their participation.

The above is a clinical trial exclusion criterion. Annotated with entity spans:
Known [Condition: immediate] or [Condition: delayed hypersensitivity reaction] or [Condition: idiosyncrasy] to [Drug: drugs chemically related to panitumumab] or excipients that contraindicates their participation.